Subjects must be undergoing unilateral or bilateral mastectomy with tissue expander reconstruction

The above is a clinical trial inclusion criterion. Annotated with entity spans:
Subjects must be [Temporal: undergoing] [Qualifier: unilateral] or [Qualifier: bilateral] [Procedure: mastectomy] with [Procedure: tissue expander reconstruction]